降血糖藥物acarbose的主要作用機轉為何？
A. 減少胰島素被肝臟代謝分解作用
B. 抑制腸道中α-葡萄糖苷酶（α-glucosidases）的活性，干擾碳水化合物的消化及減慢醣類吸收速率
C. 促進胰臟胰島素的分泌作用
D. 增加肝醣的生合成（glycogen synthesis）

正確答案：B. 抑制腸道中α-葡萄糖苷酶（α-glucosidases）的活性，干擾碳水化合物的消化及減慢醣類吸收速率